Clinical trial inclusion criteria:
Patient must be 18 years or older
Must meet the following definition for adhesive capsulitis as defined by the American Academy of Orthopedic Surgeons: Self-limiting condition resulting from any inflammatory process about the shoulder in which capsular scar tissue is produced, resulting in pain and limited range of motion; also called frozen shoulder
Must be amenable to randomization into either cohort

Annotated entities:
- Person: "years"
- Value: "18 or older"
- Condition: "adhesive capsulitis"
- Measurement: "American Academy of Orthopedic Surgeons"
- Non-query-able: "Self-limiting condition resulting from any inflammatory process about the shoulder in which capsular scar tissue is produced, resulting in pain and limited range of motion; also called frozen shoulder"
- Post-eligibility: "Must be amenable to randomization into either cohort"